Clinical trial inclusion criterion:
Hoehn and Yahr stage = 3

Entity relations:
- Has_value("Hoehn and Yahr", "stage = 3")